Clinical trial inclusion criterion:
Weight at least 45 kg

Entity relations:
- Has_value("Weight", "at least 45 kg")